Clinical trial inclusion criteria:
Willing to receive three doses of an FDA-approved Hepatitis B vaccine
Volunteer chronically infected with HCV (as demonstrated by serology and/or viral load laboratory studies)
Healthy volunteer without significant medical problems

Annotated entities:
- Post-eligibility: "Willing to receive three doses of an FDA-approved Hepatitis B vaccine"
- Condition: "HCV infected"
- Qualifier: "chronically"
- Person: "volunteer"
- Qualifier: "Healthy"